previous OHSS

The above is a clinical trial exclusion criterion. Annotated with entity spans:
[Temporal: previous] [Condition: OHSS]